presents with signs and symptoms of a SSTI

The above is a clinical trial inclusion criterion. Annotated with entity spans:
presents with [Condition: signs] and [Condition: symptoms] of a [Condition: SSTI]